Clinical trial exclusion criterion:
Pregnant patients

Annotated entities:
- Condition: "Pregnant"